All renal (only) male and female recipients aged = 60, years undergoing kidney transplantation from a living or deceased donor, including Expanded Criteria Donors (ECD).

The above is a clinical trial inclusion criterion. Annotated with entity spans:
All renal (only) [Person: male] and [Person: female] [Condition: recipients] [Measurement: aged] [Value: = 60], years undergoing [Procedure: kidney transplantation] from a [Qualifier: living] or [Qualifier: deceased donor], including [Qualifier: Expanded Criteria Donors (ECD)].